Patients with head trauma or Neurosurgical intervention

The above is a clinical trial exclusion criterion. Annotated with entity spans:
Patients with [Condition: head trauma] or [Procedure: Neurosurgical intervention]